El aspecto xantoncrómico de un líquido cefalorraquídeo se debe a la presencia de:
1. Ceruplasmina.
2. Cisteína.
3. Bilirrubina.
4. Urea.

Respuesta correcta: 3. Bilirrubina.